Medical history of cardiovascular disease, malignant cancer, diabetes or kidney disease

The above is a clinical trial exclusion criterion. Annotated with entity spans:
Medical history of [Condition: cardiovascular disease], [Condition: malignant cancer], [Condition: diabetes] or [Condition: kidney disease]